Which company produces Eligard?

Eligard is produced by Astellas Pharma GmbH.